HIV positive with documentation present in source document.

The above is a clinical trial inclusion criterion. Annotated with entity spans:
[Condition: HIV positive] with documentation present in source document.